Current pregnancy

The above is a clinical trial exclusion criterion. Annotated with entity spans:
[Temporal: Current] [Condition: pregnancy]